陳女士，60 歲，5 年前診斷有 C 型肝炎相關之肝硬化。最近之檢驗值為白蛋白（albumin）3.3 g/dL，凝血酶原時間（prothrombin time）比對照值延長 5 秒，膽紅素 2.5 mg/dL，理學檢查發現有輕度肝腦病變（hepatic encephalopathy），腹部超音波檢查有大量腹水（ascites）。陳女士之 Child-Pugh 分類為何？
A. A
B. B
C. C
D. D

正確答案：C. C